下列何者不共同形成跟腱（calcaneal tendon）？
A. 腓腸肌（gastrocnemius）
B. 比目魚肌（soleus）
C. 膕肌（popliteus）
D. 蹠肌（plantaris）

正確答案：C. 膕肌（popliteus）